20. Inadequate venous access

The above is a clinical trial exclusion criterion. Annotated with entity spans:
[Parsing_Error: 20.] [Qualifier: Inadequate] [Device: venous access]